Clinical trial inclusion criterion:
Has had no recent close contact with a person with active TB or, if there has been such contact, will undergo additional evaluations and receive appropriate treatment for latent TB

Annotated entities:
- Observation: "close contact"
- Temporal: "recent"
- Observation: "person with active TB"
- Non-representable: "Has had no recent close contact with a person with active TB or, if there has been such contact, will undergo additional evaluations and receive appropriate treatment for latent TB"